Clinical trial exclusion criterion:
3. Patients with other nervous system diseases(e.g., cerebral tumor, neurinoma, trigeminal neuralgia,etc)

Entity relations:
- Subsumes("nervous system diseases", "cerebral tumor")
- OR("cerebral tumor", "neurinoma", "trigeminal neuralgia")